En relación con los factores de riesgo de las enfermedades cardiovasculares, ¿cuál de las siguientes afirmaciones NO es correcta?
1. En cuanto al colesterol LDL, el objetivo terapéutico depende del riesgo cardiovascular global.
2. Los pacientes diabéticos tipo 2 deben considerarse de alto riesgo cardiovascular y el objetivo en cuanto a colesterol LDL debe ser <100 mg/dL.
3. No hay evidencia suficiente de que niveles bajos de colesterol HDL supongan un factor de riesgo cardiovascular.
4. Lo importante en el riesgo asociado a hipertensión arterial es que mejora cuando se reduce la presión arterial independientemente del tipo de fármaco utilizado.
5. La existencia de enfermedad coronaria en la familia es un factor de riesgo para el paciente.

Respuesta correcta: 3. No hay evidencia suficiente de que niveles bajos de colesterol HDL supongan un factor de riesgo cardiovascular.